severe respiratory comorbidities (e.g. chronic obstructive pulmonary disease, pneumonia, respiratory failure)

The above is a clinical trial exclusion criterion. Annotated with entity spans:
[Qualifier: severe] [Condition: respiratory comorbidities] (e.g. [Condition: chronic obstructive pulmonary disease], [Condition: pneumonia], [Condition: respiratory failure])